Clinical trial exclusion criterion:
Ongoing substance use disorder with significant impact on activities of daily living. Difficult or impossible to determine whether cognitive or functional decline is due to substance use or HIV, or both

Annotated entities:
- Condition: "substance use disorder"
- Temporal: "Ongoing"
- Condition: "impact on activities of daily living"
- Non-query-able: "Difficult or impossible to determine whether cognitive or functional decline is due to substance use or HIV, or both"